Clinical trial exclusion criterion:
Failure to record HA data for at least 80% of days during the Screening Period

Entity relations:
- Has_multiplier("Failure to record HA data", "for at least 80% of days")
- Has_temporal("Failure to record HA data", "during the Screening Period")